下列何者和神經性梅毒（neurosyphilis）相互有關聯？
A. Argyll-Robertson pupil
B. Marcus-Gunn pupil
C. Horner's pupil
D. Adie's pupil

正確答案：A. Argyll-Robertson pupil